最近新上市一種抗氣喘藥物，您發現氣喘病人治療幾個月後，不僅相關臨床症狀消失，檢測血液中抗原特異 性IgE抗體效價也降低，而且也偵測不到抗原特異性CD4+ T細胞分泌的IL-4、IL-5及IL-13，這種抗氣喘藥物可能具有調節免疫反應的功能，下列那種細胞最不可能與這種治療效果有關？
A. 第一型輔助性T細胞（TH1）
B. TR1細胞
C. 第十七型輔助性T細胞（TH17）
D. CD4+ CD25+ T細胞

正確答案：C. 第十七型輔助性T細胞（TH17）